Clinical trial exclusion criterion:
inability to communicate in English

Annotated entities:
- Condition: "inability to communicate in English"